Clinical trial exclusion criterion:
2. Best corrected visual acuity (BCVA) at baseline <20/200.

Entity relations:
- Has_index("at baseline", "baseline")
- Has_temporal("Best corrected visual acuity (BCVA)", "at baseline")
- Has_value("Best corrected visual acuity (BCVA)", "<20/200")